History of malignancy of any organ system (other than localized basal cell carcinoma of the skin), treated or untreated, within the past 5 years, regardless of whether there is evidence of local recurrence or metastases.

The above is a clinical trial exclusion criterion. Annotated with entity spans:
[Temporal: History] of [Condition: malignancy] of [Qualifier: any organ system] ([Negation: other than] [Condition: localized basal cell carcinoma of the skin]), [Qualifier: treated] or [Qualifier: untreated], [Temporal: within the past 5 years], [Non-representable: regardless of whether there is evidence of local recurrence or metastases].